Women with singleton pregnancy.

The above is a clinical trial inclusion criterion. Annotated with entity spans:
[Person: Women] with [Condition: singleton pregnancy].